當懷疑病人有乾眼症時，下列那種檢查最常使用以檢測淚腺分泌功能的低下？
A. Rose Bengal score
B. slit lamp examination
C. Schirmer's test
D. lacrimal gland biopsy

正確答案：C. Schirmer's test